Clinical trial inclusion criterion:
Previously treated with ADASUVE® with a positive outcome (responders) according to (CGI-I) scale (defined as having a CGI-I score of 1 or 2 at 2 hours after administration of the inhalation)

Entity relations:
- Has_value("CGI-I score", "1 or 2")
- Has_temporal("CGI-I score", "2 hours after administration of the inhalation)")
- Has_index("2 hours after administration of the inhalation)", "administration of the inhalation)")